Clinical trial inclusion criterion:
known platelet count < 100.000/µL at the time of screening

Annotated entities:
- Measurement: "platelet count"
- Value: "< 100.000/µL"
- Temporal: "at the time of screening"
- Reference_point: "the time of screening"